Has other dermatological conditions that may interfere with clinical assessments

The above is a clinical trial exclusion criterion. Annotated with entity spans:
[Subjective_judgement: Has other dermatological conditions that may interfere with clinical assessments]